Children receiving amoxicilline-clavulanic acid (50-90 mg/kg/day, twice daily) due to acute otitis media or acute sinusitis

The above is a clinical trial inclusion criterion. Annotated with entity spans:
[Person: Children] receiving [Drug: amoxicilline-clavulanic acid] ([Value: 50-90 mg/kg/day], [Multiplier: twice daily]) due to [Condition: acute otitis media] or [Condition: acute sinusitis]